Es un género de bacterias anaerobias estrictas que producen endosporas y que contienen especies patógenas:
1. Bacteroides.
2. Bacillus.
3. Clostridium.
4. Corynebacterium
5. Mycobacterium.

Respuesta correcta: 3. Clostridium.